Serum potassium >=5.1 mmol/L or <3.5 mmol/L at screening, confirmed by a single repeat if deemed necessary.

The above is a clinical trial exclusion criterion. Annotated with entity spans:
[Measurement: Serum potassium] [Value: >=5.1 mmol/L] or [Value: <3.5 mmol/L] [Temporal: at screening], confirmed by a single repeat if deemed necessary.